Severe bronchial asthma or severe chronic obstructive pulmonary disease.

The above is a clinical trial exclusion criterion. Annotated with entity spans:
[Qualifier: Severe] [Condition: bronchial asthma] or [Qualifier: severe] [Condition: chronic obstructive pulmonary disease].